previous adverse reaction or known allergy to local anaesthetics or opioids or paracetamol

The above is a clinical trial exclusion criterion. Annotated with entity spans:
previous [Condition: adverse reaction] or known [Condition: allergy] to [Procedure: local anaesthetics] or [Drug: opioids] or [Drug: paracetamol]